下列何者屬B群鏈球菌（Group B Streptococci）？
A. 化膿性鏈球菌（Streptococcus pyogenes）
B. 草綠色鏈球菌（viridans streptococci）
C. 無乳鏈球菌（Streptococcus agalactiae）
D. 轉糖鏈球菌（Streptococcus mutans）

正確答案：C. 無乳鏈球菌（Streptococcus agalactiae）